What is Nextflow?

Nextflow is a flow management framework that uses container technology to insure efficient deployment and reproducibility of computational analysis pipelines.